Generally healthy, postmenopausal woman who seeks treatment for hot flushes.

The above is a clinical trial inclusion criterion. Annotated with entity spans:
Generally [Condition: healthy], [Condition: postmenopausal] [Person: woman] who seeks treatment for [Condition: hot flushes].